¿Cómo podemos mejorar la eficacia de la exposición en el tratamiento de las fobias específicas?:
1. Extendiendo el tiempo trascurrido entre sesiones.
2. Prolongando la duración de las sesiones de exposición.
3. Asociando a la terapia de exposición la toma de benzodiacepinas.
4. Empleando la exposición imaginada en lugar de la exposición en vivo.

Respuesta correcta: 2. Prolongando la duración de las sesiones de exposición.